En el contexto del análisis de los factores que influyen en el resultado de la psicoterapia, señale cuál de los siguientes puede considerarse un factor (técnica) específica (versus otro tipo de factores, como p. ej., cambio extraterapéutico, factores comunes):
1. Efecto placebo.
2. Fomentar experiencias de éxito en el curso de la terapia.
3. Establecimiento de una relación de confianza.
4. Uso de la empatía.
5. La economía de fichas.

Respuesta correcta: 5. La economía de fichas.